Clinical trial inclusion criterion:
Moderate to severe COPD (post-bronchodilator forced expiratory volume in 1 s (FEV1) 30-79%predicted);

Entity relations:
- Has_qualifier("COPD", "Moderate to severe")
- Has_value("forced expiratory volume in 1 s (FEV1)", "30-79%predicted")
- Has_qualifier("forced expiratory volume in 1 s (FEV1)", "post-bronchodilator")